Clinical trial inclusion criterion:
Subject must be able to change to Salbutamol/Albuterol MDI rescue for the duration of the study and judged capable of withholding albuterol/salbutamol for at least 6 hours prior to study visits.

Entity relations:
- AND("MDI rescue", "Albuterol")
- AND("MDI rescue", "Salbutamol")
- AND("change", "MDI rescue")
- Has_mood("change", "able to")
- multi("for the duration of the study", "the duration of the study")
- AND("capable of withholding", "albuterol")
- Has_multiplier("capable of withholding", "for at least 6 hours")
- Has_temporal("capable of withholding", "prior to study visits")
- Has_temporal("change", "for the duration of the study")
- AND("capable of withholding", "salbutamol")